Clinical trial exclusion criterion:
History of or intercurrent diphtheria, tetanus, pertussis, hepatitis B, polio, and Haemophilus influenzae type b diseases.

Entity relations:
- AND("History", "diphtheria")
- OR("diphtheria", "Haemophilus influenzae type b", "hepatitis B", "pertussis", "tetanus", "polio")